上皮內淋巴細胞（intraepithelial lymphocytes, IELs）主要包含二群 CD8+ T 細胞，一群為 CD8 α:α T 細胞，另一群為 CD8 α:β T 細胞，下列有關這二群細胞之敘述，何者正確？
A. 二者皆可利用 perforin 及 granzyme 毒殺受感染的上皮細胞
B. 二者皆利用 T 細胞受體與呈現抗原的 MHC class I 分子結合
C. 二者皆主要以 naïve T 細胞型式存在上皮細胞之間
D. 二者的 T 細胞受體變異性（TCR diversity）皆很小

正確答案：A. 二者皆可利用 perforin 及 granzyme 毒殺受感染的上皮細胞